Clinical trial inclusion criterion:
Subjects were able to comply with the protocol and the restrictions and assessments therein.

Annotated entities:
- Post-eligibility: "Subjects were able to comply with the protocol and the restrictions and assessments therein."